Surgical treatment history (except anti-reflux treatment) or esophageal radiotherapy,

The above is a clinical trial exclusion criterion. Annotated with entity spans:
[Procedure: Surgical treatment] [Temporal: history] ([Negation: except] [Procedure: anti-reflux treatment]) or [Procedure: esophageal radiotherapy],